Clinical trial exclusion criterion:
Acute angle closure glaucoma is suspected

Annotated entities:
- Condition: "Acute angle closure glaucoma"
- Mood: "suspected"